Clinical trial inclusion criterion:
Age = 18 years and = 50 years

Entity relations:
- Has_value("Age", "= 18 years and = 50 years")